Which database contains gene expression data for yeast?

The ExpressDB database is a database for yeast RNA expression data. The FED database is for fungal gene expression data for yeast.